Clinical trial inclusion criteria:
Age18-65
ASA 1-2
Elective TNTS resection of Pituitary Tumor
No narcotic before surgery as premedication
Able to Extubate

Annotated entities:
- Person: "Age"
- Value: "18-65"
- Measurement: "ASA"
- Value: "1-2"
- Procedure: "TNTS resection"
- Condition: "Pituitary Tumor"
- Qualifier: "Elective"
- Negation: "No"
- Drug: "narcotic"
- Temporal: "before surgery"
- Reference_point: "surgery"
- Procedure: "surgery"
- Mood: "Able to"
- Procedure: "Extubate"